Which is the cellular localization of the protein Opa1?

The Opa1 protein localizes to the mitochondria.